What are the major classes of retrotransposons active in the human genome?

LINE-1 (L1), Alu, SVA